Clinical trial exclusion criterion:
Positive serum antibody against Hep B surface antigen and/or core Hep B core antigen

Annotated entities:
- Measurement: "serum antibody"
- Qualifier: "Hep B surface antige"
- Qualifier: "core Hep B core antigen"
- Value: "Positive"